Patients with congenital anomalies, chromosomal anomalies, or heart defects.

The above is a clinical trial exclusion criterion. Annotated with entity spans:
Patients with [Condition: congenital anomalies], [Condition: chromosomal anomalies], or [Condition: heart defects].